Clinical trial inclusion criterion:
1. Have a finding of a mass lesion on mammography or breast MRI (BIRADS 0, 4 or 5) that is >0.5 cm and < 2 cm in size and has had or will have additional workup with focused ultrasound.

Annotated entities:
- Condition: "mass lesion"
- Procedure: "mammography"
- Procedure: "breast MRI"
- Measurement: "BIRADS"
- Value: "0, 4 or 5"
- Value: ">0.5 cm and < 2 cm"
- Measurement: "size"
- Non-query-able: "has had or will have additional workup with focused ultrasound"